Clinical trial exclusion criteria:
Have not received influenza vaccination in the past or cannot be vaccinated due to previous severe reaction to influenza vaccine, egg, latex, or thimerosol allergies, or refusal of vaccination
Participant has received a community available influenza vaccine within <6 months
History of Guillain-Barré syndrome
Immunosuppressive disorders or medications (including oral prednisone >10 mg daily, recent chemotherapy treatment)
Emergency cases as determined by the investigator or physician

Annotated entities:
- Negation: "not"
- Procedure: "influenza vaccination"
- Procedure: "influenza vaccine"
- Temporal: "within <6 months"
- Condition: "Guillain-Barré syndrome"
- Condition: "Immunosuppressive disorders"
- Drug: "Immunosuppressive medications"
- Drug: "oral prednisone"
- Multiplier: ">10 mg daily"
- Procedure: "chemotherapy"
- Non-query-able: "Emergency cases as determined by the investigator or physician"